history of poorly controlled hypertension

The above is a clinical trial exclusion criterion. Annotated with entity spans:
[Temporal: history] of [Condition: poorly controlled hypertension]